Clinical trial exclusion criterion:
Platelet count < 105/mm3;

Annotated entities:
- Measurement: "Platelet count"
- Value: "< 105/mm3"